Clinical trial exclusion criterion:
Endocrine disorders such as primary aldosteronism, pheochromocytoma, hyper- or hypothyroidism, insulin-dependent diabetes mellitus

Entity relations:
- Has_qualifier("diabetes mellitus", "insulin-dependent")
- Subsumes("Endocrine disorders", "primary aldosteronism")
- OR("primary aldosteronism", "pheochromocytoma", "hyper thyroidism", "hypothyroidism", "diabetes mellitus")